IL-4 可促成以下那一種抗體之形成？
A. IgM
B. IgG3
C. IgG2a
D. IgE

正確答案：D. IgE